下列抗癲癇藥物中，何者最可能造成致命性的「史蒂文生－強生症候群（Stevens-Johnson syndrome）」？
A. topiramate
B. gabapentin
C. lamotrigine
D. valproate

正確答案：C. lamotrigine